Clinical trial exclusion criterion:
Platelet count <100g/L;

Annotated entities:
- Measurement: "Platelet count"
- Value: "<100g/L"